成熟的CD4 T細胞在活化後，可以分化為不同的effector T細胞，其中可以分泌IL-17的CD4 T細胞主要功能 是：
A. 清除胞內病原的感染
B. 清除胞外細菌的感染
C. 毒殺胞外的寄生蟲
D. 抑制T細胞過度的發炎反應

正確答案：B. 清除胞外細菌的感染